Clinical trial exclusion criterion:
Coagulopathies (with prothrombin concentration less than 60% or INR more than 1.5)

Entity relations:
- Has_value("prothrombin concentration", "less than 60%")
- Has_value("INR", "more than 1.5")
- AND("Coagulopathies", "prothrombin concentration")
- OR("prothrombin concentration", "INR")